Disease which affect efficacy and safety of drugs

The above is a clinical trial exclusion criterion. Annotated with entity spans:
[Drug: Disease] which [Qualifier: affect efficacy] and [Qualifier: safety of drugs]